¿Cuáles de las siguientes pruebas se encuadra dentro de los Test de factor G?
1. El test de habilidades mentales primarias (PMA).
2. El test de matrices progresivas (Raven).
3. La batería de aptitudes diferenciales (DAT).
4. Las escalas McCarthy (MSCA).
5. Las escalas Bayley de desarrollo infantil.

Respuesta correcta: 2. El test de matrices progresivas (Raven).